Milller Class 4 recession defects

The above is a clinical trial exclusion criterion. Annotated with entity spans:
[Measurement: Milller] [Value: Class 4] [Condition: recession defects]